Clinical trial exclusion criterion:
Patients with chronic obstructive pulmonary disease who are on systemic corticosteroids.

Entity relations:
- AND("chronic obstructive pulmonary disease", "systemic corticosteroids")